Clinical trial exclusion criterion:
current moderate or severe alcohol/drug use disorder or in the past 8 weeks

Entity relations:
- Has_qualifier("alcohol use disorder", "moderate")
- Has_temporal("alcohol use disorder", "in the past 8 weeks")
- OR("alcohol use disorder", "drug use disorder")
- OR("moderate", "severe")